Clinical trial exclusion criterion:
Persons presently receiving or having a recent history of receiving (within the past six months) any medication or therapeutic modality that affects the immune system such as allergy shots, immune globulin, interferon, immunomodulators, radiation therapy, cytotoxic drugs or drugs known to be frequently associated with significant major organ toxicity, or systemic corticosteroids (oral or injectable). Inhaled and topical corticosteroids are allowed.

Entity relations:
- Has_qualifier("drugs known to be frequently associated with significant major organ toxicity", "known to be frequently associated with significant major organ toxicity")
- Has_qualifier("systemic corticosteroids", "oral")
- Has_qualifier("any medication", "affects the immune system")
- Subsumes("any medication", "allergy shots")
- Has_temporal("any medication", "within the past six months")
- OR("any medication", "therapeutic modality")
- OR("oral", "injectable")
- OR("allergy shots", "immune globulin", "interferon", "immunomodulators", "radiation therapy", "cytotoxic drugs", "drugs known to be frequently associated with significant major organ toxicity", "systemic corticosteroids")